No antiangiogenic concomitant treatment, 15 days before and 15 days after radioembolization, including Sorafenib

The above is a clinical trial exclusion criterion. Annotated with entity spans:
[Negation: No] [Procedure: antiangiogenic] concomitant treatment, [Temporal: 15 days before] and [Temporal: 15 days after radioembolization], including [Drug: Sorafenib]